Clinical trial exclusion criterion:
Known or suspected disorders of immunoglobulin synthesis.

Annotated entities:
- Condition: "disorders of immunoglobulin synthesis"
- Qualifier: "Known"
- Qualifier: "suspected"